¿Qué es el PCNA o antígeno nuclear de proliferación celular?
1. Es una proteína que impide que se vuelva a formar la doble hélice en la burbuja de replicación.
2. Es una proteína que aumenta la capacidad de replicar fragmentos largos de la DNA polimerasa eucariota.
3. Es la proteína responsable de la eliminación de superhélices positivas.
4. Es la conformación típica de la doble hélice del DNA en eucariotas.
5. Es la enzima encargada de copiar el DNA de los telómeros.

Respuesta correcta: 2. Es una proteína que aumenta la capacidad de replicar fragmentos largos de la DNA polimerasa eucariota.